Clinical trial exclusion criterion:
Signs or symptoms suspicious for Primary HIV Infection (PHI).

Annotated entities:
- Condition: "Primary HIV Infection"
- Condition: "PHI"
- Condition: "symptoms"
- Condition: "Signs"